Established diagnosis of diabetes mellitus

The above is a clinical trial exclusion criterion. Annotated with entity spans:
Established diagnosis of [Condition: diabetes mellitus]